Clinical trial exclusion criteria:
previous use of insulin pump
pregnancy or planning to become pregnant in the next 2 years,
lack of ability to use the study devices
history of severe chronic diseases
recent or concomitant use of corticosteroids
drug or alcohol abuse
psychiatric complaints that interfere with the correct use of the devices

Annotated entities:
- Device: "insulin pump"
- Condition: "pregnancy"
- Mood: "planning to become"
- Condition: "pregnant"
- Temporal: "in the next 2 years"
- Negation: "lack of"
- Observation: "ability to use the study devices"
- Device: "study devices"
- Qualifier: "severe"
- Condition: "chronic diseases"
- Temporal: "history"
- Temporal: "recent"
- Temporal: "concomitant"
- Drug: "corticosteroids"
- Drug: "drug abuse"
- Drug: "alcohol abuse"
- Condition: "psychiatric complaints"
- Observation: "correct use of the devices"
- Mood: "interfere with"